Clinical trial exclusion criterion:
Patient has diabetes or is immunodepressed.

Entity relations:
- OR("diabetes", "immunodepressed")